La adrenalina en el músculo y el glucagón en el hígado:
1. Activan la adenilato ciclasa.
2. Activan la glucógeno sintasa.
3. Estimulan la lipogénesis.
4. Disminuyen la lipolisis.

Respuesta correcta: 1. Activan la adenilato ciclasa.